Clinical trial inclusion criterion:
Patient is aged 18 years and over (>=21y in Singapore).

Annotated entities:
- Person: "aged"
- Value: "18 years and over"
- Value: ">=21y"
- Person: "Singapore"